下列何者症狀不屬於思考形式障礙（formal thought disorders）？
A. 意念飛躍（flight of ideas）
B. 新語症（neologism）
C. 思考停頓（thought blocking）
D. 被害妄想（persecutory delusion）

正確答案：D. 被害妄想（persecutory delusion）